CD4+ T細胞活化的過程中，除需要signal 1 外，還需要適當的signal 2，下列對signal 2 的敘述，何者錯誤？
A. CD4+ T細胞會表現CD28 與抗原呈現細胞的B7 分子結合，使CD4+ T細胞進入活化狀態
B. 如果CD4+ T細胞與抗原呈現細胞結合時，缺少signal 2 的訊號，CD4+ T細胞主要會進行凋亡作用（
C. 如果CD4+ T細胞表現CTLA-4 分子與抗原呈現細胞的B7 分子結合，主要會導致CD4+ T細胞失能（
D. CD28 與 CTLA-4 分子皆會與 B7 分子結合，但是 CTLA-4 與 B7 的親和力高於 CD28

正確答案：B. 如果CD4+ T細胞與抗原呈現細胞結合時，缺少signal 2 的訊號，CD4+ T細胞主要會進行凋亡作用（